Clinical trial exclusion criterion:
Absolute neutrophil count less than 750 cells/mm3 even if receiving G-CSF.

Entity relations:
- Has_value("Absolute neutrophil count", "less than 750 cells/mm3")
- Has_qualifier("less than 750 cells/mm3", "even if receiving G-CSF")